Clinical trial exclusion criterion:
Use of other products intended for weight loss including prescription drugs, over-the-counter (OTC) drugs, and herbal preparations within 1 month before Screening

Annotated entities:
- Drug: "products intended for weight loss"
- Qualifier: "prescription"
- Qualifier: "over-the-counter (OTC)"
- Qualifier: "herbal"
- Temporal: "within 1 month before Screening"
- Reference_point: "Screening"